Clinical trial exclusion criteria:
Acute heart failure or acute exacerbation of chronic heart failure within the past 2 weeks.
Scheduled cardiac resynchronization therapy or heart transplantation.
History of malignant tumor or life expectancy under 12 months.
Already on medications that may affect thyroid function (L-T4, carbimazole, propylthiouracil, amiodarone, lithium).
Pregnancy and lactation period.
Participation in another clinical trial within the past 30 days.
Contraindication or intolerance to evidence-based therapy for CHF, such as beta-blocker, angiotensin-converting enzyme inhibitor or angiotensin receptor blocker.
Known hypersensitivity to the trial treatment(s) or diluents (when applicable), including placebo or other comparator drug(s).
Untreated adrenal insufficiency.
Untreated pituitary insufficiency.
Untreated thyrotoxicosis.
Treatment with levothyroxine must not be initiated in patients with acute myocardial infarction, acute myocarditis, or acute pancarditis.
Severe renal dysfunction (eGFR=30 ml/min/1.73m2).
Significant hepatic impairment (Serum GPT > 120 U/L).
Any disorder which, in the opinion of the investigator, might jeopardise subject's safety or compliance with the protocol.

Annotated entities:
- Condition: "Acute heart failure"
- Condition: "exacerbation"
- Qualifier: "acute"
- Condition: "chronic heart failure"
- Temporal: "within the past 2 weeks"
- Procedure: "cardiac resynchronization therapy"
- Procedure: "heart transplantation"
- Condition: "malignant tumor"
- Person: "life expectancy"
- Value: "under 12 months"
- Drug: "medications"
- Measurement: "thyroid function"
- Value: "affect"
- Drug: "L-T4"
- Drug: "carbimazole"
- Drug: "propylthiouracil"
- Drug: "amiodarone"
- Drug: "lithium"
- Condition: "Pregnancy"
- Condition: "lactation period"
- Non-query-able: "Participation in another clinical trial within the past 30 days."
- Condition: "Contraindication"
- Condition: "intolerance"
- Procedure: "evidence-based therapy"
- Condition: "CHF"
- Drug: "beta-blocker"
- Drug: "angiotensin-converting enzyme inhibitor"
- Drug: "angiotensin receptor blocker"
- Procedure: "trial treatment(s)"
- Drug: "trial diluents"
- Condition: "hypersensitivity"
- Drug: "placebo"
- Qualifier: "other"
- Drug: "comparator drug(s)"
- Condition: "adrenal insufficiency"
- Qualifier: "Untreated"
- Condition: "pituitary insufficiency"
- Qualifier: "Untreated"
- Condition: "thyrotoxicosis"
- Qualifier: "Untreated"
- Drug: "levothyroxine"
- Condition: "acute myocardial infarction"
- Negation: "not be initiated"
- Procedure: "Treatment"
- Condition: "acute myocarditis"
- Condition: "acute pancarditis"
- Condition: "renal dysfunction"
- Qualifier: "Severe"
- Measurement: "eGFR"
- Value: "=30 ml/min/1.73m2"
- Condition: "hepatic impairment"
- Qualifier: "Significant"
- Measurement: "Serum GPT"
- Value: "> 120 U/L"
- Post-eligibility: "Any disorder which, in the opinion of the investigator, might jeopardise subject's safety or compliance with the protocol."